Clinical trial exclusion criterion:
Subject with a history of prostatectomy because of prostate cancer, including nerve sparing techniques. Subjects with a history of surgical procedures for the treatment of benign prostate hypertrophy are permitted, with the exception of cryosurgery, cryotherapy or cryoablation

Entity relations:
- AND("prostatectomy", "prostate cancer")
- Subsumes("prostatectomy", "nerve sparing techniques")
- AND("surgical procedures", "benign prostate hypertrophy")
- Has_negation("surgical procedures", "permitted")
- AND("cryosurgery", "benign prostate hypertrophy")
- Has_temporal("surgical procedures", "history of")
- Has_negation("cryosurgery", "with the exception of")
- OR("cryosurgery", "cryotherapy", "cryoablation")